Use of Traditional Chinese Medication or alternative therapies

The above is a clinical trial exclusion criterion. Annotated with entity spans:
Use of [Procedure: Traditional Chinese Medication] or [Procedure: alternative therapies]